Known to have active viral hepatitis (B or C)

The above is a clinical trial exclusion criterion. Annotated with entity spans:
Known to have [Qualifier: active] [Condition: viral hepatitis] ([Qualifier: B] or [Qualifier: C])